Clinical trial exclusion criterion:
Any other clinical condition that, in the opinion of the investigator, might pose additional risk to the subject due to participation in the study.

Annotated entities:
- Non-representable: "Any other clinical condition that, in the opinion of the investigator, might pose additional risk to the subject due to participation in the study."